Clinical trial exclusion criterion:
Acute myocardial infarction or acute coronary syndrome, transient ischemic attack or stroke within the last 3 months.

Entity relations:
- Has_index("within the last 3 months", "the last 3 months")
- Has_temporal("Acute myocardial infarction", "within the last 3 months")
- OR("Acute myocardial infarction", "transient ischemic attack", "acute coronary syndrome", "stroke")